Clinical trial inclusion criterion:
Subjects with a measured post-albuterol/salbutamol forced expiratory volume in 1 second (FEV1)/(forced vital capacity)FVC ratio of <=0.70 at Screening (Visit 1).

Annotated entities:
- Drug: "albuterol"
- Drug: "salbutamol"
- Temporal: "post-albuterol/salbutamol"
- Measurement: "forced expiratory volume in 1 second (FEV1)/(forced vital capacity)FVC ratio"
- Value: "<=0.70"
- Temporal: "at Screening"
- Qualifier: "post-albuterol/salbutamol"
- Reference_point: "albuterol/salbutamol"